When was vivotif first licenced in Europe?

The vaccine vivotif was first licensed in Europe in 1983.